Clinical trial exclusion criterion:
Current or history of suicidal ideation

Entity relations:
- Has_temporal("suicidal ideation", "Current")
- OR("Current", "history")